Child-Pugh score <12

The above is a clinical trial inclusion criterion. Annotated with entity spans:
[Measurement: Child-Pugh score] [Value: <12]